下列何者不需要事先取得病人的告知後同意？
A. 手術前抽取病人10cc血液進行HIV檢測
B. 將手術摘取的廢棄人體組織用作國科會的研究
C. 手術中，讓住院醫師負責下刀及縫合
D. 注射顯影劑

正確答案：C. 手術中，讓住院醫師負責下刀及縫合